在患者的腦脊髓液中看到快速移動的阿米巴，將其滴入蒸餾水中數小時後，則可看到其轉變為具兩根鞭毛的鞭毛蟲，此人最可能感染的寄生蟲是：
A. 福氏內格里阿米巴（Naegleria fowleri）
B. 痢疾阿米巴（Entamoeba histolytica）
C. 巴氏阿米巴（Balamuthia mandrillaris）
D. 棘阿米巴（Acanthamoeba spp.）

正確答案：A. 福氏內格里阿米巴（Naegleria fowleri）